Clinical trial inclusion criterion:
Adult men and women (=18 years).

Entity relations:
- Has_value("years", "=18 years")
- Subsumes("Adult", "years")
- OR("men", "women")